List the ten types of conjoined twins.

Thoraco-omphalopagus: Two bodies fused from the upper chest to the lower chest. These twins usually share a heart, and may also share the liver or part of the digestive system.
Thoracopagus:Two bodies fused from the upper thorax to lower belly. The heart is always involved in these cases.
Omphalopagus: Two bodies fused at the lower abdomen. Unlike thoracopagus, the heart is never involved in these cases.
Pyopagus: joined at the buttocks with sacrum and coccyx anomalies
Rachipagus: Joined at the spine with vertebral and neural tube defects
Ischiopagus: joined at the hip from umbilicus to conjoined pelvis
Parasitic twins: Twins that are asymmetrically conjoined, resulting in one twin that is small, less formed, and dependent on the larger twin for survival.
Craniopagus: Fused skulls, but separate bodies
Cephalopagus: head but not face or foramen magnum, brains are usually separate
Dicephalus dipus dibrachius: 2 heads and one body